9. Ability to complete the study procedures in compliance with the protocol.

The above is a clinical trial inclusion criterion. Annotated with entity spans:
[Parsing_Error: 9.] [Post-eligibility: Ability to complete the study procedures in compliance with the protocol.]